Clinical trial inclusion criteria:
Age = 18 years
American Society of Anesthesiologists Classification I-III
Normal cognitive function in order to sign written, informed consent and to understand trial protocol
Agreement to the trial protocol, including the randomized manner

Annotated entities:
- Person: "Age"
- Value: "= 18 years"
- Observation: "American Society of Anesthesiologists Classification"
- Value: "I-III"
- Value: "Normal"
- Measurement: "cognitive function"
- Observation: "Agreement to the trial protocol"
- Observation: "Agreement to the randomized manner"